一位 50 歲女性主訴右耳耳鳴約半年，耳鳴聲在夜間特別明顯，且跳動聲與脈搏跳動完全一致。何者最不適合作為下一步檢查？
A. 耳鏡檢查（otoscopic examination）
B. 以聽診器聽耳部及頸部的 bruit
C. 安排顳顎關節攝影檢查
D. 安排頸動脈超音波檢查

正確答案：C. 安排顳顎關節攝影檢查